一位 31 歲男性，無明顯藥物史及過去病史，因口吐鮮血由朋友送急診室醫治，病人朋友告知病人與同事喝醉酒，先嘔吐兩次吐出食物，第三次嘔吐發現多量鮮血參雜少量食物。下列上消化道出血疾病中，首要考慮之鑑別診斷為：
A. 食道靜脈瘤破裂
B. 胃潰瘍
C. 十二指腸潰瘍
D. Mallory-Weiss 裂傷

正確答案：D. Mallory-Weiss 裂傷